Clinical trial inclusion criteria:
Subject must be at least 30 years of age.
Subject is able to verbally confirm understandings of risks, benefits and treatment alternatives of receiving the Vitamin C+E or Statin or Dual, and he/she or his/her legally authorized representative provides written informed consent prior to any study related procedure.
Subject must have symptoms that are consistent with vasospastic angina with planned Coronary angiography and Provocation test.

Annotated entities:
- Person: "age"
- Value: "at least 30 years"
- Post-eligibility: "Subject is able to verbally confirm understandings of risks, benefits and treatment alternatives of receiving the Vitamin C+E or Statin or Dual, and he/she or his/her legally authorized representative provides written informed consent prior to any study related procedure"
- Condition: "symptoms"
- Condition: "vasospastic angina"
- Mood: "planned"
- Procedure: "Coronary angiography"
- Procedure: "Provocation test"